Clinical trial inclusion criterion:
HbA1c = 6.5 and = 10.0 %

Entity relations:
- Has_value("HbA1c", "= 6.5 and = 10.0 %")